Clinical trial inclusion criterion:
4) residual paresis in the lower extremity (Fugl-Meyer LE motor score <34),

Entity relations:
- Has_qualifier("residual paresis", "lower extremity")
- Has_value("Fugl-Meyer LE motor score", "<34")
- AND("residual paresis", "Fugl-Meyer LE motor score")